No change to AD medications within the month preceding randomization, including starting, stopping, or dosage modifications

The above is a clinical trial inclusion criterion. Annotated with entity spans:
[Negation: No] [Observation: change to AD medications] [Temporal: within the month preceding randomization], including starting, stopping, or dosage modifications